與兒童前臂橈骨和尺骨幹骨折比較，成人的橈骨和尺骨幹骨折：
A. 較常採用石膏包紮治療
B. 癒合速率較快
C. 較容易發生移位性骨折
D. 比較穩定

正確答案：C. 較容易發生移位性骨折